Juan tiene 60 años, fuma de 2 paquetes/día desde hace años y refiere desde hace 6 meses tos persistente. Comprueba que su párpado izquierdo está más caído y que la pupila de ese ojo es más pequeña. Juan refiere que la parte medial de su mano izquierda está adormecida y con menos fuerza. Su médico comprueba la ptosis palpebral y la miosis izquierda; comprueba que puede cerrar con fuerza ambos párpados simétricamente y que las dos pupilas responden correctamente a la luz. Además comprueba que no suda por la hemicara izquierda, que siente menos el pinchazo en la superficie interna de dicha mano y que tiene menos fuerza en la prensión de dicha mano. Respecto a la sintomatología ocular, ¿dónde se localiza la lesión?
1. Las fibras simpáticas, en algún nivel que abarcaría desde el hipotálamo a la columna de Clark intermedio-lateral de la médula dorsal.
2. El nervio motor ocular común izquierdo en el mesencéfalo.
3. El núcleo de Edinger-Westphal, encima del núcleo del nervio motor ocular común izquierdo.
4. Las fibras parasimpáticas, en algún nivel que abarcaría desde el núcleo de EdingerWestphal hasta el músculo constrictor de la pupila izquierda.
5. El músculo tarsal exclusivamente.

Respuesta correcta: 1. Las fibras simpáticas, en algún nivel que abarcaría desde el hipotálamo a la columna de Clark intermedio-lateral de la médula dorsal.